Revision cases

The above is a clinical trial exclusion criterion. Annotated with entity spans:
[Observation: Revision cases]